Clinical trial inclusion criterion:
Arrestees examined by a physician during detention in police cells

Entity relations:
- Has_index("during detention in police cells", "detention in police cells")
- Has_temporal("examined by a physician", "during detention in police cells")